Clinical trial inclusion criterion:
The ability to perform a small visible contraction with dorsiflexion and hip flexor muscles

Annotated entities:
- Mood: "The ability to"
- Procedure: "small visible contraction with dorsiflexion and hip flexor muscles"